Clinical trial exclusion criterion:
Psychiatric disease which difficults the adherence to the protocol, such as psychosis, obsessive-compulsive disorders, bipolar disease under treatment, diseases which require treatment with lithium and suicidal ideas in the last 5 years from the inclusion;

Entity relations:
- Has_qualifier("Psychiatric disease", "difficults the adherence to the protocol")
- Has_qualifier("bipolar disease", "under treatment")
- Subsumes("Psychiatric disease", "psychosis")
- Has_temporal("suicidal ideas", "in the last 5 years from the inclusion")
- Has_index("in the last 5 years from the inclusion", "the inclusion")
- Subsumes("Psychiatric disease", "obsessive-compulsive disorders")
- Subsumes("Psychiatric disease", "bipolar disease")
- Subsumes("Psychiatric disease", "treatment")
- Subsumes("Psychiatric disease", "lithium")
- Subsumes("Psychiatric disease", "treatment with lithium")
- Subsumes("Psychiatric disease", "suicidal ideas")
- Subsumes("Psychiatric disease", "diseases which require treatment with lithium")